一位 73 歲男性患者，每天抽菸一包達 50 年，目前仍持續抽菸，但減為每天半包。肺功能檢查 FEV1/FVC ＝60%，FEV1＝38%預測值，胸部 X 光片呈現兩側肺氣腫，右上肺葉有數個大型氣泡（bullae），病患去年有超過兩次因為呼吸困難急性加劇住院治療，下列敘述何者錯誤？
A. 依據 GOLD criteria，病患 COPD 的嚴重度應該為 stage III（severity＝severe）
B. 病患接受 MDI（metered-dose inhaler）治療，宜合併使用 inhaled long-acting β-agonist 和 corticosteroids
C. lung volume reduction surgery（LVRS）對本病患益處很少
D. 長期口服 corticosteroids 不適合用於本類病患

正確答案：C. lung volume reduction surgery（LVRS）對本病患益處很少